Una mujer de 36 años diagnosticada de esclerodermia sistémica forma difusa 2 años antes, es tratada con 30 mg de prednisona en su centro de salud por un problema ocular. La enferma consulta por cefalea y en el examen clínico se constatan cifras de presión arterial elevadas y un deterioro de la función renal que no era conocida. La enferma es derivada a urgencias con la sospecha de una crisis renal esclerodérmica. Señale cuál de las siguientes afirmaciones es la correcta:
1. La crisis renal esclerodérmica es más frecuente en la forma limitada de la esclerodermia.
2. La utilización de esteroides a dosis moderadas puede precipitar su aparición.
3. El diagnóstico requiere una biopsia renal.
4. Los inhibidores de la enzima convertidora de la angiotensina se utilizan de forma rutinaria para prevenir su aparición.
5. El tratamiento de elección sería un calcioantagonista dihidropiridínico.

Respuesta correcta: 2. La utilización de esteroides a dosis moderadas puede precipitar su aparición.